Clinical trial exclusion criterion:
History of another malignancy except: Malignancy treated with curative intent and with no known active disease present for >=5 years prior to enrolment and felt to be at low risk for recurrence by the treating physician; Adequately treated non-melanomatous skin cancer or lentigo maligna without evidence of disease; Adequately treated cervical carcinoma in situ without evidence of disease; Prostatic intraepithelial neoplasia without evidence of prostate cancer.

Entity relations:
- Has_negation("active disease", "no")
- Has_index("for >=5 years prior to enrolment", "enrolment")
- Has_mood("recurrence", "felt to be at low risk")
- Has_qualifier("treated", "Adequately")
- Has_negation("evidence of disease", "without")
- Has_qualifier("treated", "Adequately")
- Has_negation("disease", "without")
- AND("non-melanomatous skin cancer", "treated")
- AND("non-melanomatous skin cancer", "evidence of disease")
- AND("cervical carcinoma in situ", "treated")
- AND("cervical carcinoma in situ", "disease")
- Has_mood("disease", "evidence of")
- Has_mood("prostate cancer", "evidence of")
- Has_negation("prostate cancer", "without")
- AND("Prostatic intraepithelial neoplasia", "prostate cancer")
- AND("Malignancy", "treated with curative intent")
- AND("Malignancy", "active disease")
- Has_temporal("active disease", "for >=5 years prior to enrolment")
- Has_qualifier("malignancy", "another")
- Has_negation("Malignancy", "except")
- AND("malignancy", "Malignancy")
- Has_negation("recurrence", "except")
- AND("malignancy", "recurrence")
- OR("non-melanomatous skin cancer", "lentigo maligna")
- OR("non-melanomatous skin cancer", "Prostatic intraepithelial neoplasia", "cervical carcinoma in situ")
- OR("Malignancy", "treated")